Clinical trial exclusion criterion:
Cardiovascular, kidney or hepatic diseases;

Entity relations:
- OR("Cardiovascular diseases", "kidney diseases", "hepatic diseases")